Clinical trial exclusion criterion:
rearthroplasty

Annotated entities:
- Procedure: "rearthroplasty"